Clinical trial inclusion criterion:
Patients undergoing surgery with general anesthesia,

Annotated entities:
- Procedure: "surgery"
- Temporal: "undergoing"
- Qualifier: "general anesthesia"
- Procedure: "general anesthesia"